末期腎衰竭病人常出現併發症，下列敘述何者錯誤？
A. 貧血通常是 normocytic、normochromic，最主要原因是腎臟無法製造足夠的血紅生成素（ erythropoietin）
B. 病人容易出血，主要原因是血小板的功能發生問題，可以用 desmorpressin 治療
C. 病人會有高血磷症，主要是因為副甲狀腺分泌不足
D. 此時病人發生的代謝性酸血症，可能有非陰離子隙（non-anion gap）和陰離子隙（anion gap）性的混合性代謝性酸血症

正確答案：C. 病人會有高血磷症，主要是因為副甲狀腺分泌不足